月經週期中，子宮腺（uterine glands）於下列那一期會變成捲曲（coiled）並充滿肝醣（glycogen）？
A. 增殖期（proliferative phase）
B. 缺血期（ischemic phase）
C. 分泌期（secretory phase）
D. 月經期（menstrual phase）

正確答案：C. 分泌期（secretory phase）